Patients affected by synovitis;

The above is a clinical trial exclusion criterion. Annotated with entity spans:
Patients affected by [Condition: synovitis];